Clinical trial inclusion criterion:
hypoechoic uterine leiomyoma (echogenicity <3),

Entity relations:
- Has_qualifier("uterine leiomyoma", "hypoechoic")
- Has_value("echogenicity", "<3")
- Subsumes("hypoechoic", "echogenicity")